History of interstitial lung disease (ILD) e.g., interstitial pneumonitis, pulmonary fibrosis or evidence of ILD on baseline chest computer tomography.

The above is a clinical trial exclusion criterion. Annotated with entity spans:
History of [Condition: interstitial lung disease] ([Condition: ILD]) e.g., [Condition: interstitial pneumonitis], [Condition: pulmonary fibrosis] or [Mood: evidence of] [Condition: ILD] on [Temporal: baseline] [Procedure: chest computer tomography].